Clinical trial inclusion criteria:
Subject's ability to lay in a supine position with their hands at their sides during CVP measurements
A consent form signed by the patient or patient's representative
Subjects that are age 18-90
Subjects that have an indwelling CICC and are transitioning to a PICC for long-term IV access
CICC placed in the internal jugular vein or subclavian vein position

Annotated entities:
- Observation: "ability to lay in a supine position with their hands at their sides"
- Temporal: "during CVP measurements"
- Procedure: "CVP measurements"
- Reference_point: "CVP measurements"
- Post-eligibility: "A consent form signed by the patient or patient's representative"
- Person: "age"
- Value: "18-90"
- Device: "indwelling CICC"
- Observation: "transitioning to a PICC"
- Device: "PICC"
- Device: "CICC placed"
- Qualifier: "in the internal jugular vein position"
- Qualifier: "in the subclavian vein position"